Which is the target of belimumab in Systemic Lupus Erythematosus treatment?

Belimumab: a BLyS-specific inhibitor for systemic lupus erythematosus.